Clinical trial exclusion criterion:
Chronic opioid consumption

Annotated entities:
- Condition: "opioid consumption"
- Qualifier: "Chronic"